Clinical trial exclusion criterion:
Pregnant, contemplating getting pregnant, or breastfeeding

Annotated entities:
- Pregnancy_considerations: "Pregnant, contemplating getting pregnant, or breastfeeding"